Clinical trial inclusion criterion:
source of infection: blood, respiratory, intra abdominal or urinary

Annotated entities:
- Non-representable: "source of infection: blood, respiratory, intra abdominal or urinary"